下列何者最不可能是卵巢過度刺激症（ovarian hyperstimulation syndrome）的致病因子？
A. 雌激素
B. 黃體素
C. 腎素（renin）
D. 血管緊縮素（angiotensin）

正確答案：B. 黃體素